一位 50 歲婦女，過去曾因子宮頸癌接受過骨盆腔放射線治療，最近三年有頻尿、急尿及膀胱脹尿時疼痛的症狀，但排尿後疼痛可以減輕。尿液檢查並沒有白血球或紅血球增加，病人也沒有尿液滲漏的現象，排尿量約 100 毫升，沒有殘尿。請問她最可能的診斷為：
A. 間質性膀胱炎
B. 放射性膀胱炎
C. 膀胱過動症
D. 細菌性膀胱炎

正確答案：B. 放射性膀胱炎